Clinical trial exclusion criterion:
serious concomitant illness and malignant tumor of any kind

Annotated entities:
- Condition: "illness"
- Temporal: "concomitant"
- Qualifier: "serious"
- Condition: "malignant tumor"
- Qualifier: "any kind"